Clinical trial inclusion criterion:
Need of lower third molar surgeries

Entity relations:
- Has_qualifier("surgeries", "lower third molar")